What is epitranscriptomics?

Epitranscriptomics is the fast expanding area of RNA modifications.